患者神經學檢查，肱三頭肌反射（triceps reflex）有減弱或消失，三頭肌乏力，則第幾頸神經最可能有病變？
A. 五
B. 六
C. 七
D. 八

正確答案：C. 七